Clinical trial inclusion criterion:
9. Ability to complete the study procedures in compliance with the protocol.

Annotated entities:
- Parsing_Error: "9."
- Post-eligibility: "Ability to complete the study procedures in compliance with the protocol."
- Subjective_judgement: "Ability to complete the study procedures in compliance with the protocol."